一位 50 歲男性有慢性腎衰竭病史，主訴近兩日呼吸困難，身體診察發現：心跳每分鐘 120 次、血壓 80/52 mmHg、頸靜脈怒張、心音微弱、肺部兩側並無呼吸性囉音，心電圖顯示竇性頻脈，深吸氣時摸不到脈搏，請問最有可能的診斷是：
A. 心包膜填塞（pericardial tamponade）
B. 急性冠狀動脈症候群（acute coronary syndrome）
C. 肺動脈高壓症（pulmonary hypertesion）
D. 鬱血性心衰竭（congestive heart failure）

正確答案：A. 心包膜填塞（pericardial tamponade）